Clinical trial inclusion criterion:
Patient is hemodynamically stable, hemoglobin >10 mg/dL

Annotated entities:
- Condition: "hemodynamically stable"
- Measurement: "hemoglobin"
- Value: ">10 mg/dL"